La RNA Polimerasa I de eucariotas transcribe los genes de:
1. Los precursores de los mRNAs.
2. Los precursores de los tRNAs.
3. Los RNAs ribosómicos 18S, 5,8S y 28S.
4. Todos los precursores de los RNAs celulares.
5. Los RNAs catalíticos.

Respuesta correcta: 3. Los RNAs ribosómicos 18S, 5,8S y 28S.